造成前三個月妊娠流產（abortion）最常見之原因為：
A. 內分泌失調
B. 胎兒染色體或基因異常
C. 子宮或生殖泌尿道之畸形
D. 孕婦新陳代謝障礙

正確答案：B. 胎兒染色體或基因異常